Clinical trial inclusion criterion:
Positive Anti-Mitochondrial Antibodies (AMA) titers (>1/40 on immunofluorescence or M2 positive by enzyme linked immunosorbent assay (ELISA) or positive PBC-specific antinuclear antibodies

Annotated entities:
- Measurement: "Positive Anti-Mitochondrial Antibodies (AMA) titers"
- Value: ">1/40"
- Measurement: "immunofluorescence"
- Value: "M2 positive"
- Measurement: "enzyme linked immunosorbent assay (ELISA)"
- Measurement: "PBC-specific antinuclear antibodies"
- Value: "positive"